有位感染Mycobacterium leprae（M. leprae）的病人前來就診，經過檢	發現血液中對抗M. leprae的抗體效價很高，而寄生在巨噬細胞內的M. leprae很多，臨床症狀顯示有嚴重的組織破壞，下列那種細胞的活化最有可能與病人臨床症狀有關？
A. 第一型輔助性T細胞（TH1）
B. 第二型輔助性T細胞（TH2）
C. 第三型輔助性T細胞（TH3）
D. 調節性T細胞（regulatory T cell）

正確答案：B. 第二型輔助性T細胞（TH2）